Successful cardiac ablation for AF

The above is a clinical trial inclusion criterion. Annotated with entity spans:
[Qualifier: Successful] [Procedure: cardiac ablation] for [Condition: AF]